Post-procedural thrombolysis in myocardial infarction (TIMI) grade 3 flow in treated vessels

The above is a clinical trial inclusion criterion. Annotated with entity spans:
[Condition: Post-procedural thrombolysis] in [Condition: myocardial infarction] ([Measurement: TIMI]) grade [Value: 3] flow in [Qualifier: treated vessels]